Age >18

The above is a clinical trial inclusion criterion. Annotated with entity spans:
[Person: Age] [Value: >18]